inability to understand trial Information

The above is a clinical trial exclusion criterion. Annotated with entity spans:
[Post-eligibility: inability to understand trial Information]